Clinical trial exclusion criterion:
Malignancy and other significant medical conditions that will impact follow up within this program.

Annotated entities:
- Condition: "Malignancy"
- Condition: "medical conditions"
- Qualifier: "significant"